世界衛生組織在 2001 年的年度世界健康報告中，關於精神疾病之評估，下列何者正確？
A. 全球因精神疾病所造成的負擔，逐年在減少當中
B. 過去不曾有人因為精神醫學的相關研究而獲得諾貝爾奬
C. 人類至今無法針對活人之大腦進行即時的功能性評估
D. 在基層照護（primary care）中提供精神疾病的治療，是該年度報告中的第一項建議

正確答案：D. 在基層照護（primary care）中提供精神疾病的治療，是該年度報告中的第一項建議